Clinical trial inclusion criterion:
Subjects who need antipsychotic treatment (other than clozapine), and would be stable when switching to long-acting injectable aripiprazole in the investigator's judgement.

Annotated entities:
- Non-representable: "Subjects who need antipsychotic treatment (other than clozapine), and would be stable when switching to long-acting injectable aripiprazole in the investigator's judgement."